下列各染色體異常與其相關疾病的配對，何者錯誤？
A. t(8;21)：Burkitt's lymphoma
B. t(9;22)：chronic myeloid leukemia
C. t(15;17)：acute promyelocytic leukemia
D. t(4;11)：acute lymphoblastic leukemia

正確答案：A. t(8;21)：Burkitt's lymphoma